Clinical trial exclusion criterion:
Intravenous (IV) iron administered within 4 weeks prior to Screening

Annotated entities:
- Drug: "iron"
- Qualifier: "IV"
- Qualifier: "Intravenous"
- Temporal: "within 4 weeks prior to Screening"
- Reference_point: "Screening"